Clinical trial exclusion criteria:
Known or suspected gram-negative infections, anaerobic infections, or fungemia
Known or suspected infections that are severe, life threatening or are not included in the ABSSSI Food and Drug Administration (FDA) guidance
Injection drug users with a fever
Severe neurological disorder leading to immobility or confined to a wheelchair
Bilateral Lower extremity involvement of the suspected infection.

Annotated entities:
- Qualifier: "gram-negative"
- Condition: "infections"
- Condition: "infections"
- Qualifier: "anaerobic"
- Condition: "fungemia"
- Condition: "infections"
- Qualifier: "severe"
- Qualifier: "life threatening"
- Person: "drug users"
- Condition: "fever"
- Condition: "neurological disorder"
- Qualifier: "Severe"
- Observation: "immobility"
- Device: "wheelchair"
- Condition: "infection"
- Qualifier: "Bilateral Lower extremity"